Clinical trial inclusion criterion:
Able to comply with the requirements of the protocol and be available for study visits over 52 weeks.

Entity relations:
- multi("available for study visits", "study visits")
- Has_temporal("available for study visits", "over 52 weeks")